在臺灣治療 group A streptococcal pharyngitis 的藥物中，下列何者最可能治療失敗？
A. oral penicillin V 10 天
B. IM benzathine penicillin single dose
C. oral first-generation cephalosporin 10 天
D. oral erythromycin 10 天

正確答案：D. oral erythromycin 10 天